鈉離子的再吸收（reabsorption）在下列何處最大？
A. 亨利氏彎管的細下降支（thin descending limb）
B. 亨利氏彎管的細上升支（thin ascending limb）
C. 亨利氏彎管的粗上升支（thick ascending limb）
D. 集尿管（collecting duct）的髓質部（inner medullary portion）

正確答案：C. 亨利氏彎管的粗上升支（thick ascending limb）